Suspected, or known addiction to or abuse of illicit drug(s), prescription medicine(s), or alcohol within the past 2 years.

The above is a clinical trial exclusion criterion. Annotated with entity spans:
Suspected, or known [Condition: addiction] to or [Condition: abuse] of [Qualifier: illicit drug](s), [Qualifier: prescription medicine](s), or [Qualifier: alcohol] within the [Temporal: past 2 years].